Which is the physiological target for LeuRS translational quality control?

QUALITY CONTROL